Moderate to severe central or mixed central and obstructive sleep apnea, defined as an apnea-hypopnea index (AHI) 15 events per hour, with a central AHI >5 events/hour

The above is a clinical trial inclusion criterion. Annotated with entity spans:
[Qualifier: Moderate] to [Qualifier: severe] [Condition: central] or [Condition: mixed central] and [Condition: obstructive sleep apnea], defined as an [Measurement: apnea-hypopnea index] ([Measurement: AHI]) [Value: 15 events per hour,] with a [Measurement: central AHI] [Value: >5 events/hour]